Where does REGN5458 bind to?

The bispecific antibody REGN5458 binds to B-cell maturation antigen (BCMA) and CD3.